Clinical trial exclusion criterion:
medical/psychiatric condition or substance abuse that is likely to affect your ability to complete this study

Entity relations:
- OR("medical condition", "substance abuse", "psychiatric condition")